History of Stevens-Johnson Syndrome and Erythema multiforme.

The above is a clinical trial exclusion criterion. Annotated with entity spans:
History of [Condition: Stevens-Johnson Syndrome] and [Condition: Erythema multiforme].